Clinical trial exclusion criterion:
Is currently participating in or has participated in an interventional clinical trial with an investigational compound or device within 30 days of signing the informed consent/assent for this current trial.

Entity relations:
- Has_index("within 30 days of signing the informed consent", "signing the informed consent")
- Has_index("within 30 days of signing the informed assent", "signing the informed assent")
- AND("currently participating in an interventional clinical trial", "investigational compound")
- Has_temporal("currently participating in an interventional clinical trial", "within 30 days of signing the informed consent")
- Has_index("within 30 days of signing the informed consent", "signing the informed assent")
- OR("currently participating in an interventional clinical trial", "has participated in an interventional clinical trial")
- OR("within 30 days of signing the informed consent", "within 30 days of signing the informed assent")
- OR("investigational compound", "device")